What is MOV10?

MOV10 is an RNA helicase